Clinical trial exclusion criterion:
Previous myocardial infarction (MI) or a percutaneous coronary intervention PCI within the past 3 months

Annotated entities:
- Condition: "myocardial infarction"
- Condition: "MI"
- Procedure: "percutaneous coronary intervention"
- Procedure: "PCI"
- Temporal: "within the past 3 months"